Clinical trial exclusion criterion:
Non-English speaking patient or parent/guardian for pediatric patients

Annotated entities:
- Non-query-able: "Non-English speaking patient or parent/guardian for pediatric patients"